Clinical trial inclusion criterion:
Have either newly diagnosed metastatic hormone sensitive prostate cancer (mHSPC) or castration-resistant metastatic prostate cancer (mCRPC) and eligible to undergo treatment with abiraterone acetate (mHSPC or mCRPC) or enzalutamide (mCRPC)

Annotated entities:
- Qualifier: "metastatic"
- Qualifier: "hormone sensitive"
- Condition: "prostate cancer"
- Condition: "mHSPC"
- Qualifier: "castration-resistant"
- Qualifier: "metastatic"
- Condition: "prostate cancer"
- Condition: "mCRPC"
- Drug: "abiraterone acetate"
- Procedure: "treatment"
- Condition: "mHSPC"
- Condition: "mCRPC"
- Drug: "enzalutamide"
- Condition: "mCRPC"